History of viscosupplementation or platelet-rich plasma to affected shoulder within the last 6 months

The above is a clinical trial exclusion criterion. Annotated with entity spans:
[Temporal: History of] [Procedure: viscosupplementation] or [Drug: platelet-rich plasma] to affected [Qualifier: shoulder] within the [Temporal: last 6 months]